Clinical trial exclusion criterion:
Prior malignancy within the previous 5 years (except for cured skin basal cell carcinoma or cervical carcinoma in situ)

Entity relations:
- Has_temporal("malignancy", "Prior")
- Has_temporal("malignancy", "within the previous 5 years")
- Has_negation("cured skin basal cell carcinoma", "except for")
- AND("malignancy", "cured skin basal cell carcinoma")
- OR("cured skin basal cell carcinoma", "cervical carcinoma in situ")